Clinical trial exclusion criterion:
Significant renal disease manifested by serum creatinine > 2.5 mg/dL

Annotated entities:
- Condition: "renal disease"
- Qualifier: "Significant"
- Measurement: "serum creatinine"
- Value: "> 2.5 mg/dL"